El número de moléculas por celda unitaria es una estructura centrada en todas las caras es de:
1. Una.
2. Dos.
3. Tres.
4. Cuatro.
5. Seis.

Respuesta correcta: 4. Cuatro.